Clinical trial exclusion criterion:
Insulin dependent Diabetes Mellitus

Annotated entities:
- Qualifier: "Insulin dependent"
- Drug: "Insulin"
- Condition: "Diabetes Mellitus"